Clinical trial inclusion criteria:
Signed written informed consent.
Age 18 to 65.
Normal and healthy (immune competent) as determined by medical history, physical exam, vital signs and clinical laboratory tests during the screening period.
If all lab results for quantitative IgA immunoglobulin level are lower than 15% below normal range, the subject may not proceed further in the screening process.
Subject must meet all required subject suitability criteria that pertain to normal source plasma donors.
Negative HIV serology during screening period.
Subject must have been previously immunized for smallpox, at =3 years prior to commencement of screening assessments, and vaccination history must be confirmed by oral or written history and the presence of a visible pathognomonic smallpox vaccination scar.
Female subjects of childbearing potential must agree to use highly effective birth control methods.

Annotated entities:
- Post-eligibility: "Signed written informed consent"
- Person: "Age"
- Value: "18 to 65"
- Qualifier: "Normal"
- Qualifier: "healthy"
- Temporal: "during the screening period"
- Reference_point: "screening period"
- Temporal: "medical history"
- Procedure: "physical exam"
- Measurement: "vital signs"
- Measurement: "clinical laboratory tests"
- Measurement: "quantitative IgA immunoglobulin level"
- Value: "lower than 15% below normal range"
- Context_Error: "If all lab results for quantitative IgA immunoglobulin level are lower than 15% below normal range, the subject may not proceed further in the screening process"
- Undefined_semantics: "Subject must meet all required subject suitability criteria that pertain to normal source plasma donors."
- Measurement: "HIV serology"
- Value: "Negative"
- Temporal: "during screening period"
- Reference_point: "screening period"
- Condition: "smallpox"
- Procedure: "immunized"
- Temporal: "3 years prior to commencement of screening assessments"
- Reference_point: "commencement of screening assessments"
- Non-query-able: "and vaccination history must be confirmed by oral or written history and the presence of a visible pathognomonic smallpox vaccination"
- Person: "Female"
- Condition: "childbearing potential"
- Procedure: "birth control methods"